Clinical trial inclusion criterion:
Age from 18 to 74 years

Entity relations:
- Has_value("Age", "from 18 to 74 years")